recent or concomitant use of corticosteroids

The above is a clinical trial exclusion criterion. Annotated with entity spans:
[Temporal: recent] or [Temporal: concomitant] use of [Drug: corticosteroids]